Clinical trial inclusion criterion:
Have experienced at least 2 moderate or severe COPD exacerbations leading to medical consultation (requiring oral corticosteroids or increasing dosage of oral corticosteroids and/or antibiotics or hospitalization) within the 12 months preceding Visit 1.

Annotated entities:
- Multiplier: "at least 2"
- Qualifier: "severe"
- Qualifier: "moderate"
- Condition: "COPD exacerbations"
- Drug: "oral corticosteroids"
- Drug: "oral corticosteroids"
- Qualifier: "increasing dosage"
- Drug: "antibiotics"
- Visit: "hospitalization"
- Temporal: "within the 12 months preceding Visit 1"